Clinical trial exclusion criterion:
choroidal neovascularization caused by other eye diseases

Annotated entities:
- Condition: "choroidal neovascularization"
- Condition: "other eye diseases"
- Qualifier: "other"